Clinical trial inclusion criteria:
Elderly patients over 65 years old exhibiting clinical indices of cardiovascular disease
Male or female
Subjects who were hospitalized in the Geriatric Unit of the Emile Roux Hospital (AP-HP)
MMSE (Mini Mental State Examination)score > or = 15
Supervision available for study medication
Able to ingest oral diet

Annotated entities:
- Person: "old"
- Value: "over 65 years"
- Person: "Elderly"
- Undefined_semantics: "clinical indices of cardiovascular disease"
- Person: "Male"
- Person: "female"
- Visit: "Geriatric Unit of the Emile Roux Hospital (AP-HP)"
- Measurement: "MMSE (Mini Mental State Examination)"
- Value: "score > or = 15"
- Non-query-able: "Supervision available for study medication"
- Condition: "Able to ingest oral diet"
- Non-query-able: "Able to ingest oral diet"